Clinical trial inclusion criterion:
Not in treatment with anti-resorptive agents (like bisphosphonates and denosumab) for more than 4 consecutive years, in order to reduce the risk of medication-related osteonecrosis of the jaws (Lo et al., 2010).

Entity relations:
- Subsumes("anti-resorptive agents", "bisphosphonates")
- Has_temporal("anti-resorptive agents", "more than 4 consecutive years,")
- Has_negation("anti-resorptive agents", "Not")
- OR("bisphosphonates", "denosumab")